Clinical trial inclusion criterion:
Life expectancy >/= 4 months for maintenance cohorts and >/= 6 months for adjuvant cohorts

Annotated entities:
- Observation: "Life expectancy"
- Value: ">/= 4 months"
- Context_Error: "maintenance cohorts"
- Observation: "maintenance cohorts"
- Value: ">/= 6 months"
- Observation: "adjuvant cohorts"